Clinical trial exclusion criterion:
BMI greater than 35 or less than 20

Annotated entities:
- Measurement: "BMI"
- Value: "greater than 35"
- Value: "less than 20"